La Terapia de Solución de Problemas para la depresión incluye dentro de sus propuestas:
1. Entrenar las respuestas de relajación en el paciente como medio para mejorar la reflexión y la búsqueda de soluciones.
2. Favorecer que el paciente tome acciones positivas, sean cuales sean, aunque no vayan dirigidas a resolver ningún problema específico.
3. Entrenar estrategias de habilidades sociales que ayuden a resolver problemas importantes.
4. Buscar los problemas en su infancia y adolescencia que pueden estar repercutiendo en su depresión actual.
5. Minimizar el impacto de los síntomas depresivos sobre los intentos de solución.

Respuesta correcta: 5. Minimizar el impacto de los síntomas depresivos sobre los intentos de solución.